Producen la resorción ósea:
1. Fibroblastos.
2. Osteoblastos.
3. Osteoclastos.
4. Osteocitos.
5. Osteona.

Respuesta correcta: 3. Osteoclastos.